Clinical trial inclusion criteria:
Inborn preterm infants born between 28 0/7 and 34 0/7 weeks gestation and fed either mother's own milk or donor human milk

Annotated entities:
- Person: "infants"
- Value: "between 28 0/7 and 34 0/7 weeks"
- Measurement: "gestation"
- Condition: "Inborn"
- Condition: "preterm"
- Observation: "fed mother's own milk"
- Observation: "donor human milk fed"